一位 20 歲女孩一向月經很正常，2 個月前接受人工流產手術後月經量突然減少，總共只有 2 天，而且一天只用一片衛生棉，最適當的處置為何？
A. 子宮鏡檢查
B. 抽血檢查荷爾蒙，包括 FSH, estradiol, prolactin
C. 給予高劑量雌激素以幫助子宮內膜生長
D. 安排子宮擴刮術（D&C），並放置避孕器

正確答案：A. 子宮鏡檢查